Clinical trial inclusion criterion:
Patients with known or newly diagnosed T2D (type 2 diabetes is diagnosed according to current WHO criteria or by the use of anti-diabetic drugs)

Annotated entities:
- Condition: "T2D"